Clinical trial exclusion criterion:
Patients HIV+.

Entity relations:
- Has_value("HIV", "+")
- Subsumes("HIV+", "HIV")